Clinical trial exclusion criterion:
Current dialysis treatment.

Annotated entities:
- Procedure: "dialysis treatment"
- Temporal: "Current"